李媽媽腎臟衰竭到了末期，接受透析治療一段時間後，接受了腎臟移植。由一陌生的車禍腦死捐贈者得到一枚腎臟。李媽媽與捐贈者的主要組織抗原（Major Histocompatibility Complex）測試定型是完全相同的。但是李媽媽腎臟移植之後仍出現排斥反應，其原因可能為何？
A. 目前主要組織抗原測試定型的精確度尚有不足。而且次要組織抗原（Minor Histocompatibility
B. 李媽媽長期透析治療，引起過高的異體免疫反應（alloreactivity）
C. 腎臟移植手術時，種入之腎臟中帶有捐贈者之免疫細胞而引起之植入物抗宿主（graft versus host）免疫反應
D. 因捐贈者為 B 肝帶原（HBsAg positive），植入之腎臟中之 HBsAg 引起連串免疫反應進行導致排斥反應

正確答案：A. 目前主要組織抗原測試定型的精確度尚有不足。而且次要組織抗原（Minor Histocompatibility